Clinical trial inclusion criterion:
Willing and able to provide informed written consent

Annotated entities:
- Post-eligibility: "Willing and able to provide informed written consent"